Clinical trial exclusion criterion:
History of cancer in the preceding 2 years other than successfully treated, non-metastatic, squamous cell or basal cell carcinoma, or cervical cancer in situ.

Annotated entities:
- Condition: "cancer"
- Temporal: "preceding 2 years"
- Negation: "other"
- Condition: "cervical cancer in situ"
- Condition: "basal cell carcinoma"
- Condition: "carcinoma squamous cell"
- Qualifier: "non-metastatic"
- Qualifier: "successfully treated"